Significant psychological co-morbidity as assessed subjectively by the investigator

The above is a clinical trial exclusion criterion. Annotated with entity spans:
[Qualifier: Significant] [Condition: psychological co-morbidity] [Subjective_judgement: as assessed subjectively by the investigator]